Clinical trial inclusion criterion:
No evidence of arterial disease (Arterial Duplex or Ankle Brachial Pressure Index >0.9)

Entity relations:
- Has_negation("arterial disease", "No")
- Has_value("Ankle Brachial Pressure Index", ">0.9")
- AND("Arterial Duplex", "arterial disease")
- OR("Arterial Duplex", "Ankle Brachial Pressure Index")